Clinical trial exclusion criterion:
Abnormal liver enzymes (Aspartate transaminase (AST), Alanine transaminase (ALT), or alkaline phosphatase > 2.5 times the upper limit of normal)

Annotated entities:
- Measurement: "liver enzymes"
- Measurement: "Aspartate transaminase (AST)"
- Measurement: "Alanine transaminase (ALT)"
- Measurement: "alkaline phosphatase"
- Value: "> 2.5 times the upper limit of normal"
- Value: "Abnormal"